Clinical trial inclusion criterion:
ECOG PS: 0,1

Entity relations:
- Has_value("ECOG PS", "0,1")